心臟細胞之興奮-收縮（excitation-contraction coupling）作用與下列何種離子在細胞內之濃度的增加有關？
A. 鈉
B. 鉀
C. 鈣
D. 氯

正確答案：C. 鈣